What is the clinical indication of cardiac T1 mapping magnetic resonance?

The clinical indication of cardiac T1 mapping magnetic resonance is the detection  of diffuse myocardial fibrosis in nonischemic cardiomyopathies